Clinical trial exclusion criterion:
Being pregnant or plan on immediately becoming pregnant

Annotated entities:
- Condition: "pregnant"
- Mood: "plan on immediately becoming"
- Condition: "pregnant"